Clinical trial inclusion criterion:
Body mass index 25-35 kg/m2

Annotated entities:
- Measurement: "Body mass index"
- Value: "25-35 kg/m2"